下列何者為尿道外括約肌（external urethral sphincter）所在處？
A. 膀胱頸
B. 膜部尿道
C. 前列腺尿道
D. 陰莖部尿道

正確答案：B. 膜部尿道